下列上肢肌肉中，何者止（insertion）於皮膚？
A. 掌長肌（palmaris longus）
B. 掌短肌（palmaris brevis）
C. 小魚際肌（hypothenar muscles）
D. 魚際肌（thenar muscles）

正確答案：B. 掌短肌（palmaris brevis）